Clinical trial exclusion criterion:
pregnant or breastfeeding women

Annotated entities:
- Condition: "pregnant"
- Observation: "breastfeeding"
- Person: "women"